Clinical trial inclusion criterion:
oral anticoagulation that cannot be safely discontinued for the duration of the study

Annotated entities:
- Procedure: "oral anticoagulation"
- Qualifier: "cannot be safely discontinued"
- Temporal: "for the duration of the study"
- Reference_point: "the study"